Clinical trial exclusion criterion:
6. Chest pain lasting longer than 30 minutes within 12 hours pre-procedure, if CK enzymes positive (≥ 2x the normal upper limit).

Annotated entities:
- Condition: "Chest pain"
- Qualifier: "lasting longer than 30 minutes"
- Temporal: "within 12 hours pre-procedure"
- Measurement: "CK enzymes"
- Value: "positive"
- Value: "≥ 2x the normal upper limit"